Clinical trial inclusion criterion:
Severe hypernatraemia

Annotated entities:
- Condition: "hypernatraemia"
- Qualifier: "Severe"